La mesalazina se utiliza en terapéutica en el tratamiento de:
1. El asma bronquial en niños.
2. La cinetosis.
3. El Síndrome de Gilles de la Tourette.
4. La enfermedad de Crohn.
5. El hipogonadismo.

Respuesta correcta: 4. La enfermedad de Crohn.